Hyperglycemic (Glucose level > 126 mg/dL)

The above is a clinical trial inclusion criterion. Annotated with entity spans:
[Condition: Hyperglycemic] ([Measurement: Glucose level] [Value: > 126 mg/dL])